List drugs that are included in the Vosevi polypill.

Vosevi pill includes sofosbuvir, velpatasvir and voxilaprevir. It is approved by the US Food and Drug Administration (FDA) for adult patients with chronic hepatitis C virus (HCV) infection without cirrhosis or with compensated cirrhosis (Child-Pugh A) who have: genotype 1, 2, 3, 4, 5, or 6 infection and have previously been treated with an HCV regimen containing an NS5A inhibitor; and genotype 1a or 3 infection and have previously been treated with an HCV regimen containing sofosbuvir without an NS5A inhibitor.